下列那一疾病比較不會併發骨質疏鬆症？
A. hyperthyroidism
B. Cushing's syndrome
C. hypogonadism
D. hyperaldosteronism

正確答案：D. hyperaldosteronism